What is the active ingredient in the most common hand sanitizer?

The active ingredient is isopropyl alcohol, which is an alcohol-based hand sanitizer.